Clinical trial exclusion criterion:
Patient still in an exclusion period following the participation in another clinical trial.

Entity relations:
- Has_temporal("participation in another clinical trial", "still in an exclusion period following")